Clinical trial inclusion criterion:
18-35 years old

Annotated entities:
- Person: "old"
- Value: "18-35 years"